Clinical trial inclusion criteria:
Ambulatory status (outpatient) at time of consent
Age 10-55 years
Clinical diagnosis of Autism Spectrum Disorder
IQ greater than or equal to 70
Score greater than 8 on Children's Yale-Brown Obsessive Compulsive Scale
Free of psychoactive medication for at least: one month for fluoxetine; two weeks for other SSRIs and neuroleptics; and five days for stimulants prior to MRI scanning [excepting stable doses (greater than three months duration) of anticonvulsant medication for seizure disorder]

Annotated entities:
- Visit: "Ambulatory status"
- Visit: "outpatient"
- Temporal: "at time of consent"
- Value: "10-55 years"
- Person: "Age"
- Condition: "Autism Spectrum Disorder"
- Qualifier: "Clinical diagnosis"
- Measurement: "IQ"
- Value: "greater than or equal to 70"
- Measurement: "Children's Yale-Brown Obsessive Compulsive Scale"
- Value: "greater than 8"
- Drug: "psychoactive medication"
- Negation: "Free of"
- Temporal: "at least one month"
- Temporal: "at least two weeks"
- Temporal: "at least five days"
- Drug: "fluoxetine"
- Drug: "SSRIs"
- Drug: "neuroleptics"
- Drug: "stimulants"
- Temporal: "prior to MRI scanning"
- Drug: "anticonvulsant medication"
- Condition: "seizure disorder"
- Temporal: "greater than three months"
- Qualifier: "stable doses"
- Negation: "excepting"